Clinical trial exclusion criterion:
2. Screening tool: physical assessment (EKG), medical history.

Annotated entities:
- Parsing_Error: "2."
- Parsing_Error: "Screening tool: physical assessment (EKG), medical history."
- Not_a_criteria: "Screening tool: physical assessment (EKG), medical history."